Written informed consent from legal representative(s)

The above is a clinical trial inclusion criterion. Annotated with entity spans:
[Informed_consent: Written informed consent from legal representative(s)]